Clinical trial exclusion criterion:
Patients who cannot or do not want to give informed consent (including language barriers)

Annotated entities:
- Observation: "give informed consent"
- Negation: "cannot"
- Negation: "do not want to"
- Observation: "language barriers"